Subjects must be pre-adolescent without any signs of puberty (Tanner Stage 1).

The above is a clinical trial inclusion criterion. Annotated with entity spans:
Subjects must be [Person: pre-adolescent] [Negation: without any] [Condition: signs of puberty] ([Measurement: Tanner Stage] [Value: 1]).